Clinical trial exclusion criterion:
Living in a nursing home.

Annotated entities:
- Visit: "nursing home"
- Observation: "Living"